46,XX,5p-的染色體報告代表下列何者？
A. 女生第五對染色體數目上少了一整條
B. 女生第五對染色體長臂上少了一小截
C. 女生第五對染色體短臂上少了一小截
D. 女生第五對染色體發生平衡轉位（balanced translocation）

正確答案：C. 女生第五對染色體短臂上少了一小截